一位 33 歲的張先生很喜歡慢跑，最近他每天傍晚都到家附近的小山坡路跑 1～2 小時。結果他發現左膝外側、大腿骨下端隆起處，在膝關節彎曲、伸直的動作中會有尖銳的疼痛；但是膝關節全伸直和彎曲超過 90 度時，卻又不感到疼痛。他改以騎自行車來運動，結果幾天下來，這個問題更糟糕。 張先生最有可能發生了：
A. 外側副韌帶（lateral collateral ligament）拉傷
B. 髂脛束摩擦症候群（iliotibial band friction syndrome）
C. 股二頭肌（biceps femoris muscle）肌腱炎
D. 外側半月板（lateral meniscus）損傷

正確答案：B. 髂脛束摩擦症候群（iliotibial band friction syndrome）